BMI < 28

The above is a clinical trial inclusion criterion. Annotated with entity spans:
[Measurement: BMI] [Value: < 28]